Vaccination less than 6 weeks prior to treatment with Lemtrada.

The above is a clinical trial exclusion criterion. Annotated with entity spans:
[Drug: Vaccination] [Temporal: less than 6 weeks prior to treatment with Lemtrada].